Clinical trial exclusion criterion:
Participants taking CPI combination therapies with chemotherapy are not permitted.

Annotated entities:
- Procedure: "CPI combination therapies"
- Procedure: "chemotherapy"